How can B-cells transdifferentiate into macrophages?

C/EBPβ-expressing B cells produced granulocyte-macrophage progenitor progenitors when subjected to selective pressure to eliminate lymphoid cells . The absence of PAX-5 could have triggered B cells to differentiate into macrophages and dendritic cells . Tet2 helps CEBPα rapidly derepress myeloid genes during conversion of pre-B cells .